Clinical trial exclusion criterion:
allergy to morphine or ketamine

Annotated entities:
- Condition: "allergy"
- Drug: "morphine"
- Drug: "ketamine"